Clinical trial exclusion criterion:
1. Congestive heart failure;

Annotated entities:
- Condition: "Congestive heart failure"